Clinical trial exclusion criterion:
Severe renal insufficiency (Creatinine Clearance < 30 ml/min).

Annotated entities:
- Qualifier: "Severe"
- Condition: "renal insufficiency"
- Measurement: "Creatinine Clearance"
- Value: "< 30 ml/min"